Evidence of significant physical illness contraindicating the use of levomilnacipran and duloxetine found on the physical exam or in the laboratory data obtained during the first week of the study

The above is a clinical trial exclusion criterion. Annotated with entity spans:
Evidence of significant [Condition: physical illness] [Condition: contraindicating] the use of [Drug: levomilnacipran] and [Drug: duloxetine] found on the [Procedure: physical exam] or in the [Procedure: laboratory] data obtained [Temporal: during the first week of the study]